下列何種病毒複製時，會在細胞質產生一種稱為內基氏小體（Negri body）的包涵體？
A. 天花病毒（variola virus）
B. 狂犬病病毒（rabies virus）
C. 人類巨細胞病毒（human cytomegalovirus）
D. 水痘-帶狀疱疹病毒（varicella-zoster virus）

正確答案：B. 狂犬病病毒（rabies virus）